Clinical trial exclusion criterion:
The "as-needed" (prn) use of psychoactive and other drugs such as antibiotics is not excluded; however, such use must be discussed with a clinician prescriber and documented.

Annotated entities:
- Non-representable: "The "as-needed" (prn) use of psychoactive and other drugs such as antibiotics is not excluded; however, such use must be discussed with a clinician prescriber and documented."